Breastfeeding women unwilling to temporarily stop breastfeeding

The above is a clinical trial exclusion criterion. Annotated with entity spans:
[Non-representable: Breastfeeding women unwilling to temporarily stop breastfeeding]